Describe PWMScan

pwmscan is a fast web-based tool to scan server-resident genomes for matches to a user-supplied pwm or transcription factor binding site model from a public database.